下列何者為最常見的生殖細胞腫瘤（germ-cell tumor）？
A. 惡性胚胎瘤（dysgerminoma）
B. 絨毛膜癌（choriocarcinoma）
C. 內胚層竇瘤（endodermal sinus tumor）
D. 成熟性畸胎瘤（mature teratoma）

正確答案：D. 成熟性畸胎瘤（mature teratoma）